Clinical trial exclusion criterion:
Myocardial infarction and heart surgery up to three months before the survey;

Annotated entities:
- Condition: "Myocardial infarction"
- Procedure: "heart surgery"
- Temporal: "up to three months before the survey"